Patient unable to receive either propofol or isoflurane due to allergy or other specific contraindication.

The above is a clinical trial exclusion criterion. Annotated with entity spans:
Patient [Condition: unable to receive] either [Drug: propofol] or [Drug: isoflurane] due to [Condition: allergy] or other specific contraindication.